Clinical trial exclusion criterion:
3. Has a condition or history that, in the opinion of the investigator, may interfere significantly with the subject's participation in the study.

Annotated entities:
- Parsing_Error: "3."
- Subjective_judgement: "in the opinion of the investigator"
- Subjective_judgement: "may interfere significantly"
- Non-query-able: "may interfere significantly"